Clinical trial exclusion criterion:
Positive Antigen HBs in the screening evaluation;

Entity relations:
- Has_value("Antigen HBs", "Positive")
- Has_temporal("Antigen HBs", "in the screening evaluation")
- Has_index("in the screening evaluation", "screening evaluation")